65歲女性因右上腹痛、黃疸及兩個月內瘦了6公斤而來求診，下列疾病中，最不可能是：
A. 膽管癌（cholangiocarcinoma）
B. 膽結石腸阻塞（gallstone ileus）
C. 肝癌細胞（hepatocellular carcinoma）
D. 胰臟癌（pancreatic carcinoma）

正確答案：B. 膽結石腸阻塞（gallstone ileus）